El control de constantes vitales es fundamental en la valoración del paciente neurológico. Muchos trastornos neurológicos pueden cursar con alteraciones del patrón o frecuencia respiratoria, indicando lesión del centro respiratorio o del sistema nervioso. Uno de estos patrones respiratorios anormales, presente en la meningitis o casos de lesión supratentorial, es la respiración de Cheyne-Stokes, caracterizada por:
1. Frecuencia regular y carácter superficial.
2. Ausencia de respiración claramente constatable.
3. Una serie de respiraciones que van aumentando de amplitud/intensidad hasta un punto máximo en que empiezan a decrecer, seguidos de una pausa de apnea.
4. Respiraciones lentas y regulares con una frecuencia inferior a 10 por minuto.
5. Se trata de un aumento anormal y mantenido tanto de la profundidad como de la frecuencia respiratoria.

Respuesta correcta: 3. Una serie de respiraciones que van aumentando de amplitud/intensidad hasta un punto máximo en que empiezan a decrecer, seguidos de una pausa de apnea.